Clinical trial exclusion criterion:
Uterine abnormalities or myoma.

Entity relations:
- OR("Uterine abnormalities", "myoma")